Cytologically proven acute lymphoblastic leukemia (ALL)

The above is a clinical trial inclusion criterion. Annotated with entity spans:
[Qualifier: Cytologically proven] [Condition: acute lymphoblastic leukemia] ([Condition: ALL])